¿Cuál de las siguientes cardiopatías congénitas NO se considera como cardiopatía que produce sobrecarga de volumen?:
1. Comunicación interauricular.
2. Comunicación interventricular.
3. Defectos del tabique aurículo-ventricular.
4. Coartación de la aorta.
5. Conducto arterioso persistente.

Respuesta correcta: 4. Coartación de la aorta.